How many Groucho-related genes (GRG) are contained in the mouse genome?

The groucho-related genes  of the mouse comprise at least four family members. The Grg gene encodes a 197 amino acid protein homologous to the amino-terminal domain of the product of the groucho gene of the Drosophila Enhancer of split complex. The murine grg  products are believed to interact with transcription factors and repress transcription, thereby regulating cell proliferation and differentiation.